Clinical trial exclusion criterion:
Women of child bearing potential, unless they are using an effective method of birth control

Annotated entities:
- Pregnancy_considerations: "Women of child bearing potential, unless they are using an effective method of birth control"